La desnaturalización de las proteínas:
1. Se acompaña de la pérdida de su actividad.
2. Supone la ruptura de enlaces peptídicos.
3. Es siempre un proceso irreversible.
4. Altera su estructura primaria.
5. La llevan a cabo proteínas chaperonas.

Respuesta correcta: 1. Se acompaña de la pérdida de su actividad.